下列那一項關於 spinal muscular atrophy 的描述錯誤？
A. 病兒會在嬰幼兒出現運動發展遲緩
B. 病兒 CPK 大多會明顯上升
C. 病兒肌肉切片的 dystrophin 表現量正常
D. 病兒的遺傳包含 autosomal dominance

正確答案：B. 病兒 CPK 大多會明顯上升